What is Synucleinopathy?

The accumulation of abnormal a-synuclein is the major histopathological feature of Lewy body disease and multiple system atrophy (MSA), which are referred to as synucleinopathies.